Clinical trial inclusion criterion:
No contraindication to CTA

Entity relations:
- AND("contraindication", "CTA")
- Has_negation("contraindication", "No")